Clinical trial exclusion criterion:
Contra-indication to Brimonidine including patients on monoamine oxidase inhibitors (MOA)

Annotated entities:
- Condition: "Contra-indication"
- Drug: "Brimonidine"
- Drug: "monoamine oxidase inhibitors"
- Drug: "MOA"